Clinical trial inclusion criterion:
Current or ex-smokers with a smoking history of at least 10 pack years (number of pack years = [number of cigarettes per day / 20] x number of years smoked, e.g., 20 cigarettes per day for 10 years, or 10 cigarettes per day for 20 years).

Annotated entities:
- Condition: "smokers"
- Measurement: "smoking history"
- Value: "10 pack years"
- Temporal: "Current"
- Negation: "ex"